下列何者不是罹患乳癌的危險因子？
A. 40 歲懷孕生第一胎小孩
B. 帶有 BRCA1 基因之變異
C. 曾罹患乳房纖維腺瘤（fibroadenoma）
D. 乳腺非典型性管道增生（atypical ductal hyperplasia）

正確答案：C. 曾罹患乳房纖維腺瘤（fibroadenoma）